¿Qué principio o actitud debe regir en la fase de “generación de soluciones alternativas” de la Terapia de Solución de Problemas?:
1. El principio de cantidad.
2. La evaluación juiciosa de cada alternativa.
3. La transferencia del paciente.
4. La utilidad esperada.
5. El análisis coste/beneficio.

Respuesta correcta: 1. El principio de cantidad.